進行子宮鏡手術時，發生低張性（hypotonic）子宮擴張液（distension media）過度吸收（overload）的臨床表現，除了茶色尿或血尿外，可能會合併的症狀不包括下列何者？
A. 呼吸不順併泡沫狀痰液（frothy sputum）
B. 意識改變（conscious change）或譫妄（delirium）
C. 寡尿（oliguria）
D. 持續大量子宮出血

正確答案：D. 持續大量子宮出血